Patients may have received prior definitive radiation therapy or surgery. At least 60 days must have elapsed since completion of definitive radiation therapy or surgery and patient must have only grade 2 or less adverse effects at the time of registration. Enrollment during palliative radiation of = 10 days, or radiation of = 10 days during the duration of the study is allowed.

The above is a clinical trial inclusion criterion. Annotated with entity spans:
Patients may have received [Temporal: prior] [Qualifier: definitive] [Procedure: radiation therapy] or [Procedure: surgery]. [Temporal: At least 60 days must have elapsed since completion of definitive radiation therapy or surgery] and patient must have only [Qualifier: grade 2 or less] [Condition: adverse effects] [Temporal: at the time of registration]. [Non-representable: Enrollment during palliative radiation of = 10 days, or radiation of = 10 days during the duration of the study is allowed.]